¿Cuál de los siguientes fármacos ha mostrado en estudios controlados que puede aumentar la eficacia de la terapia de exposición en el tratamiento de las fobias específicas?
1. Alprazolam.
2. Quetiapina.
3. D-cicloserina.
4. Bupropion.
5. Buspirona.

Respuesta correcta: 3. D-cicloserina.